small bowel resection

The above is a clinical trial exclusion criterion. Annotated with entity spans:
[Procedure: small bowel resection]